History or other evidence of a medical condition associated with chronic liver disease other than HBV (e.g., hemochromatosis, autoimmune hepatitis, metabolic liver diseases including Wilson's and alpha1-antitrypsin deficiency, alcoholic liver disease, toxin exposures, thalassemia).

The above is a clinical trial exclusion criterion. Annotated with entity spans:
History or other evidence of a [Condition: medical condition] associated with [Condition: chronic liver disease] [Negation: other than] [Condition: HBV] (e.g., [Condition: hemochromatosis], [Condition: autoimmune hepatitis], [Condition: metabolic liver diseases] including [Condition: Wilson's] and [Condition: alpha1-antitrypsin deficiency], [Condition: alcoholic liver disease], [Condition: toxin exposures], [Condition: thalassemia]).